Berlin與Fowkes所發展的文化差異處理模式（LEARN），包括那五個步驟？
A. 傾聽、評估、認知、建議、包容
B. 傾聽、評估、警覺、建議、包容
C. 傾聽、解釋、警覺、建議、妥協
D. 傾聽、解釋、認知、建議、妥協

正確答案：D. 傾聽、解釋、認知、建議、妥協